Clinical trial exclusion criterion:
IgA Deficiency

Annotated entities:
- Condition: "IgA Deficiency"